下列何種疾病為肌電圖（electromyography）檢查的禁忌症？
A. 愛滋病
B. 血友病
C. 癲癇症
D. B 型肝炎帶原者

正確答案：B. 血友病